Clinical trial exclusion criterion:
Hemodynamic unstable

Annotated entities:
- Condition: "Hemodynamic unstable"